Bismuth compounds, acid inhibitor, or antibiotics during 4 weeks before the patient is enrolled

The above is a clinical trial exclusion criterion. Annotated with entity spans:
[Drug: Bismuth compounds], [Drug: acid inhibitor], or [Drug: antibiotics] [Temporal: during 4 weeks before the patient is enrolled]